Be willing to comply with study procedures

The above is a clinical trial inclusion criterion. Annotated with entity spans:
[Informed_consent: Be willing to comply with study procedures]